Clinical trial inclusion criterion:
Inborn preterm infants born between 28 0/7 and 34 0/7 weeks gestation and fed either mother's own milk or donor human milk

Annotated entities:
- Person: "infants"
- Value: "between 28 0/7 and 34 0/7 weeks"
- Measurement: "gestation"
- Condition: "Inborn"
- Condition: "preterm"
- Observation: "fed mother's own milk"
- Observation: "donor human milk fed"